有關ansa cervicalis之敘述，何者錯誤？
A. 分布於infrahyoid muscles
B. 舌下神經（hypoglossal nerve）與第一、第二頸椎神經（C1，C2）anastomosis後形成
C. 由下方進入sternocleidomastoid muscle
D. radical surgery可清除

正確答案：C. 由下方進入sternocleidomastoid muscle